糞小桿線蟲（Strongyloides stercoralis）患者的新鮮糞便中，最常見到該寄生蟲生活史中的何種階段？
A. 胎蟲卵（embryonated egg）
B. 桿狀幼蟲（rhabditiform larva）
C. 絲狀幼蟲（filariform larva）
D. 成蟲（adult worm）

正確答案：B. 桿狀幼蟲（rhabditiform larva）